一位66歲男性高血壓病人，有30年抽菸史，年輕時有氣喘病史，最近發現有糖尿病，醫師建議加入「全民健康保險糖尿病共同照護網」。下列糖尿病照護的管理流程，那一項錯誤？
A. 每三個月檢查糖化血色素
B. 每年檢查眼底視網膜病變
C. 每年周邊動脈硬化檢查
D. 需要時安排足底神經學檢查

正確答案：C. 每年周邊動脈硬化檢查